Clinical trial exclusion criterion:
Paracetamol ingestion in the previous 48 hours

Annotated entities:
- Drug: "Paracetamol"
- Temporal: "in the previous 48 hours"